patients with haemodynamic instability of septic origin or a respiratory insufficiency (defined by a ratio Pa02/Fi02 = 200 mmHg and PEP = 5 cmH2O)

The above is a clinical trial exclusion criterion. Annotated with entity spans:
patients with [Condition: haemodynamic instability] of [Condition: septic] origin or a r[Condition: espiratory insufficiency] (defined by a ratio [Measurement: Pa02/Fi02] [Value: = 200 mmHg] and [Measurement: PEP] [Value: = 5 cmH2O])